Clinical trial exclusion criterion:
Cirrhosis hepatis (Child B or higher)

Entity relations:
- Has_value("Child", "B or higher")
- multi("Child B or higher", "Child")
- Has_qualifier("Cirrhosis hepatis", "Child B or higher")